Clinical trial exclusion criterion:
Contraindication for baclofen or toxin

Entity relations:
- AND("Contraindication", "baclofen")
- OR("baclofen", "toxin")